Clinical trial inclusion criterion:
Confirmed diagnosis of non-Burkitt B-lineage ALL

Annotated entities:
- Condition: "non-Burkitt B-lineage ALL"
- Qualifier: "Confirmed"